7. Known allergy to rice, rice bran, or related food products.

The above is a clinical trial exclusion criterion. Annotated with entity spans:
7. Known [Condition: allergy to rice], [Drug: rice bran], or [Undefined_semantics: related food products].